Clinical trial exclusion criteria:
ASA 4 or 5
revision hip arthroplasty
diagnosis of chronic pain
daily chronic opioid use (over 3 months of continuous opioid use)
inability to communicate pain scores or need for analgesia
acute hip fracture
Infection at the site of block placement
Age under 18 years old or greater than 75 years old
Pregnant women
Intolerance/allergy to local anesthetics
Weight <50 kg
Suspected, or known addiction to or abuse of illicit drug(s), prescription medicine(s), or alcohol within the past 2 years.
Uncontrolled anxiety, schizophrenia, or other psychiatric disorder that, in the opinion of the investigator, may interfere with study assessments or compliance
Current or historical evidence of any clinically significant disease or condition that, in the opinion of the investigator, may increase the risk of surgery or complicate the subject's postoperative course.

Annotated entities:
- Measurement: "ASA"
- Value: "4 or 5"
- Procedure: "revision hip arthroplasty"
- Condition: "chronic pain"
- Drug: "opioid"
- Qualifier: "chronic"
- Temporal: "over 3 months"
- Post-eligibility: "inability to communicate pain scores or need for analgesia"
- Condition: "hip fracture"
- Qualifier: "acute"
- Condition: "Infection"
- Qualifier: "site of block placement"
- Person: "Age"
- Value: "under 18 years old or greater than 75 years old"
- Pregnancy_considerations: "Pregnant women"
- Condition: "Intolerance"
- Condition: "allergy"
- Drug: "local anesthetics"
- Person: "Weight"
- Value: "<50 kg"
- Condition: "abuse"
- Condition: "addiction"
- Qualifier: "prescription medicine"
- Qualifier: "alcohol"
- Qualifier: "illicit drug"
- Temporal: "past 2 years"
- Condition: "anxiety"
- Condition: "schizophrenia"
- Condition: "psychiatric disorder"
- Non-query-able: "Current or historical evidence of any clinically significant disease or condition that, in the opinion of the investigator, may increase the risk of surgery or complicate the subject's postoperative course"